下列何者與細胞週期G1 phase進到S phase的調控關係（modulation）最少？
A. cyclin D/cdk 4
B. cyclin E/cdk 2
C. RB phosphorylation
D. cyclin B/cdk 1

正確答案：D. cyclin B/cdk 1